Clinical trial inclusion criterion:
not pregnancy or breastfeeding

Annotated entities:
- Condition: "pregnancy"
- Observation: "breastfeeding"
- Negation: "not"